Clinical trial exclusion criteria:
Receiving antibiotic and/or probiotic, 8 weeks before the study
Chronic gastrointestinal system disorders
Congenital anomalies
Chronic diseases
Chemotherapy and radiotherapy
Pregnancy

Annotated entities:
- Drug: "antibiotic"
- Drug: "probiotic"
- Temporal: "8 weeks before the study"
- Reference_point: "the study"
- Condition: "Chronic gastrointestinal system disorders"
- Condition: "Congenital anomalies"
- Condition: "Chronic diseases"
- Procedure: "Chemotherapy"
- Procedure: "radiotherapy"
- Condition: "Pregnancy"